下列關於失眠病人衛教的敘述，何者錯誤？
A. 限制白天躺床的時間
B. 如果沒有睡足六至八小時，會對健康有危害
C. 儘量在固定的時間上床睡覺
D. 睡前可泡熱水澡

正確答案：B. 如果沒有睡足六至八小時，會對健康有危害